¿Qué teoría del envejecimiento ejemplifica un ebanista de 76 años jubilado que mantiene interés por mantenerse activo y colaborar con el colegio y la parroquia del barrio en los trabajos de mantenimiento del mobiliario, puertas, piezas de madera para los niños, etc.?:
1. Teoría de la actividad.
2. Teoría de las necesidades humanas.
3. Teoría del individualismo.
4. Teoría de la continuidad.

Respuesta correcta: 4. Teoría de la continuidad.